taken any structured behavioral or exercise programs in the past 3 months

The above is a clinical trial exclusion criterion. Annotated with entity spans:
taken any [Procedure: structured behavioral] or exercise programs [Temporal: in the past 3 months]